一位 65 歲病患，被發現頸部及鼠蹊部有多個直徑 1 至 3 公分大的淋巴結，切片檢查證實為 B 細胞瀰漫型大細胞淋巴瘤（lymphoma），淋巴瘤細胞表面有 CD20 抗原表現，骨髓及內臟器官為陰性，無發燒、體重減輕或其他特殊症狀。下列何者為對此病患最適當的治療？
A. 暫時不須治療，待有症狀時再治療
B. 合併化學治療 COP（cyclophosphamide, vincristine 及 prednisolone）
C. 合併化學治療 CHOP（cyclophosphamide, adriamycin, vincristine 及 prednisolone）
D. 合併 Rituximab（anti-CD20）及化學治療 CHOP

正確答案：D. 合併 Rituximab（anti-CD20）及化學治療 CHOP